Able to perform some small wrist flexion and extension

The above is a clinical trial inclusion criterion. Annotated with entity spans:
[Mood: Able to] perform some [Procedure: small wrist flexion and extension]